claustrophobia

The above is a clinical trial exclusion criterion. Annotated with entity spans:
[Condition: claustrophobia]